32 歲男性，左小腿前側被他人以刀子刺入，他感覺到左足背側第一趾與第二趾之間有麻麻的感覺，這可能是那一條神經受到損傷？
A. 腓深神經（deep fibular nerve）
B. 腓淺神經（superficial fibular nerve）
C. 脛神經（tibial nerve）
D. 隱神經（saphenous nerve）

正確答案：A. 腓深神經（deep fibular nerve）